Clinical trial exclusion criterion:
Kellgren-Lawrence score at X-ray evaluation > 3;

Annotated entities:
- Measurement: "Kellgren-Lawrence score"
- Procedure: "X-ray evaluation"
- Value: "> 3"